Clinical trial inclusion criterion:
Female subjects aged =/> 18 years and of reproductive age.

Annotated entities:
- Person: "Female"
- Person: "aged"
- Value: "=/> 18 years"
- Condition: "reproductive age"